Clinical trial exclusion criterion:
History of active substance abuse (including alcohol > 40g/day) within the past 2 years.

Annotated entities:
- Temporal: "History"
- Qualifier: "active"
- Condition: "substance abuse"
- Measurement: "alcohol"
- Value: "> 40g/day"
- Temporal: "within the past 2 years"